Clinical trial inclusion criterion:
Serum haemoglobin of 9.5 to 14.0 g/dL

Entity relations:
- Has_value("Serum haemoglobin", "9.5 to 14.0 g/dL")